下列何者穿過喙肱肌（coracobrachialis）後支配肱二頭肌（biceps brachii）？
A. 肌皮神經（musculocutaneous nerve）
B. 正中神經（median nerve）
C. 尺神經（ulnar nerve）
D. 橈神經（radial nerve）

正確答案：A. 肌皮神經（musculocutaneous nerve）